Which epigenetic mark is deposited by PRC2?

H3K27me3 is an epigenetic mark deposited by PRC2 (Polycomb repressive complex 2).